Clinical trial exclusion criterion:
untreated thyroid pathology

Entity relations:
- Has_qualifier("thyroid pathology", "untreated")